Las células electrolíticas:
1. Tienen siempre tres electrodos.
2. Tienen siempre dos compartimentos separados por un puente salino.
3. Pueden tener un solo compartimento.
4. Siempre tienen un electrodo de referencia.
5. Utilizan siempre electrodos de platino.

Respuesta correcta: 3. Pueden tener un solo compartimento.